< 37-0 weeks of gestation

The above is a clinical trial exclusion criterion. Annotated with entity spans:
[Value: < 37-0 weeks] of [Measurement: gestation]